Endoscopic Mayo subscore >0

The above is a clinical trial inclusion criterion. Annotated with entity spans:
[Measurement: Endoscopic Mayo subscore] [Value: >0]